current or past history of psychiatric disease, alcoholism or drug abuse, and other primary sleep disorders

The above is a clinical trial exclusion criterion. Annotated with entity spans:
current or past history of [Condition: psychiatric disease], [Condition: alcoholism] or [Condition: drug abuse], and other [Condition: primary sleep disorders]